La confabulación es un síntoma típico de:
1. El juego patológico.
2. El síndrome de Munchausen.
3. El síndrome de estrés postraumático.
4. El síndrome de burn-out.
5. El síndrome amnésico.

Respuesta correcta: 5. El síndrome amnésico.